Clinical trial inclusion criterion:
measurable cutaneous or visceral metastasis

Annotated entities:
- Condition: "visceral metastasis"
- Condition: "cutaneous metastasis"
- Qualifier: "measurable"